Una muestra de hidróxido sódico carbonatada se disuelve y se valora con ácido clorhídrico. ¿Cuándo se alcanza el viraje de la fenolftaleína?:
1. La disolución contiene iones sodio, carbonato y bicarbonato.
2. La disolución contiene iones sodio y bicarbonato.
3. La disolución contiene ácido carbónico.
4. La disolución contiene ion sodio.

Respuesta correcta: 2. La disolución contiene iones sodio y bicarbonato.